Clinical trial inclusion criterion:
Patients with non-cystic fibrosis bronchiectasis diagnosed by high-resolution CT;

Entity relations:
- AND("high-resolution CT", "non-cystic fibrosis bronchiectasis")